Clinical trial exclusion criterion:
Has had a thyroidectomy or active thyroid disease requiring medication during the last 12 months (not excluded: a stable thyroid supplementation)

Annotated entities:
- Procedure: "thyroidectomy"
- Condition: "thyroid disease"
- Qualifier: "active"
- Drug: "medication"
- Temporal: "during the last 12 months"
- Drug: "thyroid supplementation"
- Qualifier: "stable"
- Negation: "not excluded"